Clinical trial exclusion criterion:
Known allergy to the study medications (probucol, sirolimus, zotarolimus)

Entity relations:
- Subsumes("study medications", "probucol")
- AND("allergy", "study medications")
- OR("probucol", "sirolimus", "zotarolimus")